Clinical trial exclusion criterion:
Uncontrolled intercurrent illness, including but not limited to ongoing or active infection requiring parenteral antibiotics at enrollment

Entity relations:
- Has_temporal("parenteral antibiotics", "at enrollment")
- Has_temporal("infection", "ongoing")
- AND("infection", "parenteral antibiotics")
- Has_qualifier("intercurrent illness", "Uncontrolled")
- Has_index("at enrollment", "enrollment")
- Subsumes("intercurrent illness", "infection")
- OR("ongoing", "active")